Which proteins induce inhibition of LINE-1 and Alu retrotransposition?

It was demonstrated that antiretroviral restriction factors, human APOBEC3 proteins A to H, differentially inhibit LINE-1 and Alu retrotransposition. The same effect was shown to be induced by the Aicardi-Goutières syndrome gene product SAMHD1.